Clinical trial inclusion criterion:
Signed Patient Informed Consent Form (ICF)

Annotated entities:
- Informed_consent: "Signed Patient Informed Consent Form (ICF)"